Clinical trial inclusion criterion:
Recent catheter insertion at beginning of the study.

Entity relations:
- Has_temporal("catheter insertion", "at beginning of the study")
- Has_temporal("catheter insertion", "Recent")
- Has_index("at beginning of the study", "beginning of the study")